48 歲洪小姐，身高 162 公分，體重 98 公斤，同時合併有糖尿病、高血壓及高血脂，她在醫師的建議下決定接受減重手術，下列何種手術較不建議？
A. 腹腔鏡胃繞道
B. 腹部抽脂手術
C. 腹腔鏡可調式胃束帶
D. 腹腔鏡胃袖狀切除

正確答案：B. 腹部抽脂手術